下視丘疾病可造成gonadotropin releasing hormone （GnRH） 分泌失調，致使腦下腺luteinizing hormorne（LH），folliclestimulating hormone（FSH）亦分泌失調，可能造成女性不孕。GnRH作用於G protein coupled receptor後，主要可活化 phospholipase C，下列敘述何者錯誤？
A. phospholipase C可分解phosphatidylinositol 4,5-bisphosphate（PIP2）
B. phosphatidylinositol 4,5-bisphosphate（PIP2）被分解為inositol 1,4,5-trisphosphate（IP3）及diacylglycerol（DAG）
C. diacylglycerol（DAG）可直接活化protein kinase A
D. inositol 1,4,5-trisphosphate（IP3）可使內質網內之Ca2+釋放

正確答案：C. diacylglycerol（DAG）可直接活化protein kinase A